Clinical trial exclusion criteria:
Hypersensitivity on Colchicine
The existence of intra-cardiac thrombus on trans-esophageal echocardiography
Pregnancy

Annotated entities:
- Condition: "Hypersensitivity"
- Drug: "Colchicine"
- Condition: "intra-cardiac thrombus"
- Procedure: "trans-esophageal echocardiography"
- Condition: "Pregnancy"